El segundo cuartil es lo mismo que la:
1. Media aritmética.
2. Media geométrica.
3. Media armónica.
4. Moda.
5. Mediana.

Respuesta correcta: 5. Mediana.